下列關於皮肌炎（dermatomyositis）之敘述，何者錯誤？
A. 部分患者會合併發生其他器官癌症
B. 肌炎症狀好發於四肢近端（proximal）部位
C. 90%以上患者有高價抗核抗體（antinuclear antibody, ANA）表現
D. 部分患者缺乏肌炎症狀之表現

正確答案：C. 90%以上患者有高價抗核抗體（antinuclear antibody, ANA）表現